Clinical trial exclusion criterion:
Pleural or interstitial disease that precludes surgery.

Entity relations:
- Has_negation("surgery", "precludes")
- Has_qualifier("Pleural disease", "precludes surgery")
- OR("Pleural disease", "interstitial disease")